Good symptom control

The above is a clinical trial inclusion criterion. Annotated with entity spans:
[Qualifier: Good] [Condition: symptom control]